Significant heart disease (chronic congestive heart failure, symptomatic coronary disease) or myocardial infarction in the previous 6 months

The above is a clinical trial exclusion criterion. Annotated with entity spans:
[Qualifier: Significant] [Condition: heart disease] ([Condition: chronic congestive heart failure], [Condition: symptomatic coronary disease]) or [Condition: myocardial infarction] [Temporal: in the previous 6 months]